Females who are pregnant or nursing.

The above is a clinical trial exclusion criterion. Annotated with entity spans:
[Person: Females] who are [Condition: pregnant] or [Condition: nursing].